Clinical trial inclusion criterion:
undergoing elective tonsillectomy with or without adenoidectomy

Annotated entities:
- Qualifier: "elective"
- Condition: "tonsillectomy"
- Condition: "adenoidectomy"